Clinical trial inclusion criterion:
Age > 18 years of age

Annotated entities:
- Person: "Age"
- Value: "> 18 years of age"